35 歲年輕女性，左外側乳癌，離乳暈 3 公分處，腫瘤大小 1 公分×1 公分，術前粗針切片（core biopsy）病理證實為浸潤性管道腺癌，腋下無觸摸到之淋巴結，則下列何種手術方法最適當？
A. 改良性根除性乳房全切除術（modified radical mastectomy）
B. 乳房保留性手術（breast conserving surgery）
C. 乳房部分切除術（partial mastectomy）
D. 乳房部分切除術（partial mastectomy）＋哨兵淋巴結手術（sentinel node biopsy）

正確答案：D. 乳房部分切除術（partial mastectomy）＋哨兵淋巴結手術（sentinel node biopsy）